Clinical trial exclusion criterion:
irreversible status of primary disease

Entity relations:
- Has_qualifier("primary disease", "irreversible status")